Clinical trial inclusion criterion:
In the opinion of the attending clinician requires dual anti-platelet therapy with aspirin and a P2Y12 receptor antagonist

Annotated entities:
- Procedure: "dual anti-platelet therapy"
- Drug: "aspirin"
- Drug: "P2Y12 receptor antagonist"
- Mood: "requires"